Clinical trial inclusion criteria:
Normal uterine cavity
Normal Hormonal investigation: TSH,PRL,FBS
Frozen embryo transfer cycles: at least 2 embryos
Primary or secondary infertility: tubal occlusion, male factor, unexplained, endometriosis, ovarian factors…
Body mass index (BMI) =18 to =30 kg/m2

Annotated entities:
- Condition: "uterine cavity"
- Qualifier: "Normal"
- Qualifier: "Normal"
- Measurement: "Hormonal investigation"
- Measurement: "TSH"
- Measurement: "PRL"
- Measurement: "FBS"
- Procedure: "Frozen embryo transfer cycles"
- Multiplier: "at least 2"
- Condition: "embryos"
- Condition: "Primary infertility"
- Condition: "secondary infertility"
- Condition: "tubal occlusion"
- Observation: "male factor"
- Observation: "unexplained factors"
- Condition: "endometriosis"
- Observation: "ovarian factors"
- Measurement: "Body mass index"
- Measurement: "BMI"
- Value: "=18 to =30 kg/m2"